Clinical trial exclusion criterion:
Use of supplements containing nitrates and supplements containing stimulants (such as ephedra) are exclusionary in the two weeks prior to initial screen (P1) visit and prohibited throughout the study. Participants who take these supplements will be asked to discontinue them for a minimum of two weeks before the Preliminary Screening Period (P1 visit)..

Entity relations:
- Subsumes("stimulants", "ephedra")
- Has_temporal("nitrates", "in the two weeks prior to initial screen (P1) visit")
- OR("nitrates", "stimulants")